El hígado convierte el etanol en:
1. Metanol.
2. Acetona.
3. Acetaldehído.
4. Peróxido de hidrógeno.
5. Glicerol.

Respuesta correcta: 3. Acetaldehído.